Use of warfarin is prohibited. Anticoagulation with low-molecular weight heparin (i.e. enoxaparin) or direct thrombin inhibitors is permitted.

The above is a clinical trial exclusion criterion. Annotated with entity spans:
Use of [Drug: warfarin] is prohibited. [Procedure: Anticoagulation] with [Drug: low-molecular weight heparin] (i.e. [Drug: enoxaparin]) or [Drug: direct thrombin inhibitors] [Grammar_Error: is permitted.]